Clinical trial exclusion criterion:
Currently taking active weight suppression medication (e.g. phentermine,orlistat, lorcaserin, naltrexone-bupropion in combination, liraglutide, benzephetamine, diethylpropion, phendimetrazine)

Annotated entities:
- Drug: "active weight suppression medication"
- Drug: "phentermine"
- Drug: "orlistat"
- Drug: "lorcaserin"
- Drug: "naltrexone-bupropion in combination"
- Drug: "liraglutide"
- Drug: "benzephetamine"
- Drug: "diethylpropion"
- Drug: "phendimetrazine"